Clinical trial exclusion criterion:
hemodialysis or peritoneal dialysis

Entity relations:
- OR("hemodialysis", "peritoneal dialysis")